Patients who have received any investigational drug in the 30 days prior to their inclusion in this study.

The above is a clinical trial exclusion criterion. Annotated with entity spans:
[Competing_trial: Patients who have received any investigational drug in the 30 days prior to their inclusion in this study.]